Clinical trial exclusion criterion:
Patients may also be excluded at the discretion of the investigator

Annotated entities:
- Non-query-able: "Patients may also be excluded at the discretion of the investigator"